¿A partir de qué compuesto y dónde mayoritariamente se produce la melatonina?:
1. A partir de tirosina en la piel.
2. A partir de triptófano en la piel
3. A partir de triptófano en la glándula pineal.
4. A partir de tirosina en la hipófisis.
5. A partir de tirosina en la glándula pineal.

Respuesta correcta: 3. A partir de triptófano en la glándula pineal.